Mutations in which gene determine response to both erlotinib and gefitinib?

Patients who carry somatic activating mutations in the tyrosine kinase domain of the epidermal growth factor receptor (EGFR) gene, respond well to erlotinib and gefitinib.